Clinical trial exclusion criterion:
Evidence of alcohol abuse or history of alcohol abuse or illegal and/or legally prescribed drugs.

Entity relations:
- Has_temporal("alcohol abuse", "history")
- OR("alcohol abuse", "alcohol abuse")
- OR("alcohol abuse", "abuse legally prescribed drugs", "abuse illegal drugs")